¿Cuál de los siguientes enunciados sobre el neumotórax es INCORRECTO:
1. Presencia de aire en la cavidad pleural.
2. El neumotórax espontaneo secundario se observa en personas con neumopatía.
3. El neumotórax a tensión pone en peligro la vida.
4. El neumotórax traumático se debe siempre a una lesión penetrante.

Respuesta correcta: 4. El neumotórax traumático se debe siempre a una lesión penetrante.